一位 60 歲女性，於一週前發生複視（diplopia），並無劇烈頭痛，神經學檢查發現：右邊上眼瞼下垂（ptosis），直視前方時，右眼向外傾斜，瞳孔對光反射（light reflex）為正常，腦脊髓液檢查及腦血管攝影檢查，結果都是正常。依上述過程判斷，何種診斷的可能性最大？
A. 後交通動脈血管瘤破裂（aneurysmal rupture of posterior communicating artery）
B. 腦經天幕脫出（transtentorial herniation）
C. 缺血性第三對顱神經病變（third cranial nerve palsy of ischemic type）
D. 海綿靜脈竇徵候群（cavernous sinus syndrome）

正確答案：C. 缺血性第三對顱神經病變（third cranial nerve palsy of ischemic type）